對吞噬細胞（phagocytes）的敘述，下列何者錯誤？
A. 巨噬細胞（macrophage）可被T淋巴球（lymphocytes）分泌的細胞激素（cytokines）所活化
B. 肝臟的 Kupffer cells 是一種特化的巨噬細胞，可吞噬細菌亦可分泌細胞激素（cytokines）
C. 嗜中性球（neutrophil）細胞內 NADPH oxidase complex活化後會合成超氧化物（superoxidant）
D. 巨噬細胞（macrophage）是由單核球（monocyte）受細菌刺激後分裂而成的

正確答案：D. 巨噬細胞（macrophage）是由單核球（monocyte）受細菌刺激後分裂而成的